下列有關交感性眼炎（sympathetic ophthalmia）的敘述，何者正確？
A. 由於交感性神經炎（sympathetic neuritis）引起的眼病變
B. 雙眼喪失協調性
C. 罕見的由於自體免疫反應引起的雙眼病變
D. 雙眼外旋肌的炎症

正確答案：C. 罕見的由於自體免疫反應引起的雙眼病變